Clinical trial inclusion criterion:
without evidence of distant metastases.

Annotated entities:
- Condition: "distant metastases"
- Negation: "without"
- Mood: "evidence"